¿En qué grupo de técnicas se incluye el Test de Apercepción Temática (TAT de Murray)?:
1. Proyectivas interpretativas.
2. Subjetivas constructivas.
3. Proyectivas constructivas.
4. Racionales gráficas.
5. Subjetivas narrativas.

Respuesta correcta: 1. Proyectivas interpretativas.